關於人工肛門（ostomies）的敘述，何者錯誤？
A. 人工肛門的位置對病人的生活品質很重要
B. 人工肛門應被置於腹直肌內並且容易被肉眼所見及方便操作
C. 人工肛門應避免被置於先前手術的疤痕處及骨頭凸出的位置
D. 直腸癌的患者術後都需要永久性人工肛門

正確答案：D. 直腸癌的患者術後都需要永久性人工肛門